Clinical trial inclusion criterion:
5. AP ≥ 1.67 × ULN

Entity relations:
- Has_value("AP", "≥ 1.67 × ULN")